Co-infection with hepatitis B virus, HIV

The above is a clinical trial exclusion criterion. Annotated with entity spans:
Co-infection with [Condition: hepatitis B virus], [Condition: HIV]